medical/psychiatric condition or substance abuse that is likely to affect your ability to complete this study

The above is a clinical trial exclusion criterion. Annotated with entity spans:
[Condition: medical]/[Condition: psychiatric condition] or [Condition: substance abuse] that is likely to affect your ability to complete this study